Clinical trial exclusion criterion:
Minor surgical procedure (e.g., open biopsy) <=7 days before first dose of study treatment, or not yet recovered from prior minor surgery Note: uncomplicated placement of vascular access device, fine needle aspiration, thoracocentesis or paracentesis >=3 days prior to first dose of study treatment is acceptable.

Entity relations:
- Subsumes("Minor surgical procedure", "open biopsy")
- Has_index("<=7 days before first dose of study treatment", "first dose of study treatment")
- Has_temporal("Minor surgical procedure", "<=7 days before first dose of study treatment")
- Has_temporal("minor surgery", "prior")
- Has_negation("recovered", "not yet")
- AND("recovered", "minor surgery")
- OR("Minor surgical procedure", "recovered")